Clinical trial exclusion criterion:
16. Concomitant administration of any food product known to alter P450 enzyme or P-gp activity such as grapefruit juice, Seville oranges

Annotated entities:
- Parsing_Error: "16."
- Temporal: "Concomitant"
- Drug: "food product known to alter P450 enzyme activity"
- Drug: "food product known to alter P-gp activity"
- Drug: "grapefruit juice"
- Drug: "Seville oranges"
- Undefined_semantics: "food product known to alter P450 enzyme or P-gp activity"